Have participated in this study previously, or any other study using exenatide or GLP-1 analogs.

The above is a clinical trial exclusion criterion. Annotated with entity spans:
Have participated in [Observation: this study] previously, or [Observation: any other study] using [Drug: exenatide] or [Drug: GLP-1 analogs].